A Juan le están realizando una toracocentesis, usted es la enfermera que se encuentra presente en el mismo y observa que el paciente comienza con palidez, disnea, taquicardia, dolor torácico y vértigo. Su sospecha que está sufriendo:
1. Infarto agudo de miocardio.
2. Atelectasia.
3. Neumotórax.
4. Pleuritis seca.

Respuesta correcta: 3. Neumotórax.